下列何者是空氣污染物自淨作用之最重要的機制？
A. 擴散
B. 重力沉降
C. 吸收
D. 雨淋

正確答案：A. 擴散